6. Persistent clinically significant non-hematological toxicity that is Grade >1 by NCI CTCAE v4 from prior chemotherapy

The above is a clinical trial exclusion criterion. Annotated with entity spans:
6. Persistent [Qualifier: clinically significant] [Qualifier: non-hematological] [Condition: toxicity] that is [Qualifier: Grade >1 by NCI CTCAE v4] from [Temporal: prior] [Procedure: chemotherapy]